Received any vaccine within a month prior to study vaccine

The above is a clinical trial exclusion criterion. Annotated with entity spans:
Received any [Procedure: vaccine] [Temporal: within a month prior to study vaccine]